Clinical trial exclusion criterion:
Chronic kidney disease with estimated Glomerular Filtration Rate < 30 ml/min/1.73 m2,

Annotated entities:
- Condition: "Chronic kidney disease"
- Measurement: "estimated Glomerular Filtration Rate"
- Value: "< 30 ml/min/1.73 m2"